1. Be able to give valid informed consent

The above is a clinical trial inclusion criterion. Annotated with entity spans:
[Parsing_Error: 1.] [Non-query-able: Be able to give valid informed consent]